El ion amonio liberado en el músculo se exporta al hígado en forma de:
1. Aminoácidos ramificados.
2. Glutamato.
3. Alanina.
4. Aminoácidos aromáticos.

Respuesta correcta: 3. Alanina.